Use of an investigational agent within 30 days.

The above is a clinical trial exclusion criterion. Annotated with entity spans:
Use of an [Drug: investigational agent] [Temporal: within 30 days].